一位 30 歲女性患有陰道癌，經各項檢查後發現腫瘤侷限在陰道上三分之一。則最好的治療方法為：
A. 陰道內 5-fluorouracil 局部塗抹
B. 陰道上半部分切除
C. 子宮頸癌根除術、兩側骨盆腔淋巴結清除及陰道上半部分切除
D. 子宮全切除術及陰道上半部分切除

正確答案：C. 子宮頸癌根除術、兩側骨盆腔淋巴結清除及陰道上半部分切除